Como es conocido, el tratamiento estrogénico puede dar lugar a diversos efectos adversos. ¿Cuál de los siguientes NO es un efecto adverso debido a esta actuación farmacológica?
1. Edema.
2. Dolor mamario.
3. Cáncer de ovario.
4. Náuseas.
5. Cefaleas.

Respuesta correcta: 3. Cáncer de ovario.